What chromosome is affected in Turner's syndrome?

Turner's syndrome (TS) is a chromosomal defect with partial or total absence of the X chromosome